12 週前之早期妊娠流產，最常見的原因為何？
A. 染色體異常
B. 感染
C. 子宮頸閉鎖不全
D. 黃體素不足

正確答案：A. 染色體異常